一位 60 歲女性主訴二個月內體重減輕 10 公斤，背痛，皮膚發黃，解茶色尿，糞便呈灰白色，右上腹部可摸到膽囊，請回答下列二題。此患者最可能之診斷為：
A. 肝炎
B. 肝硬化
C. 胰頭部癌
D. 急性膽囊炎

正確答案：C. 胰頭部癌